Clinical trial exclusion criterion:
Absolute neutrophil count less than 750 cells/mm3 even if receiving G-CSF.

Annotated entities:
- Measurement: "Absolute neutrophil count"
- Value: "less than 750 cells/mm3"
- Qualifier: "even if receiving G-CSF"